Clinical trial inclusion criterion:
female subjects who are heterosexually active and of childbearing potential (i.e., not surgically sterile or at least two years post menopausal) must practice contraception as follows from screening through completion of the study:

Entity relations:
- AND("surgically sterile", "surgically")
- Has_negation("surgically sterile", "not")
- Has_temporal("post menopausal", "at least two years")
- Has_negation("post menopausal", "not")
- Subsumes("childbearing potential", "surgically sterile")
- OR("surgically sterile", "post menopausal")